Clinical trial exclusion criterion:
3. documented allergy to any local or general anesthetic medications

Annotated entities:
- Undefined_semantics: "3. documented allergy to any local or general anesthetic medications"